測定細胞中某種特定mRNA的表現量，下列何種方法最適合？
A. Gel shift assay
B. Site-directed mutagenesis
C. Northern blotting
D. Southern blotting

正確答案：C. Northern blotting